關於人體試	之研究倫理，第一份明確主張「自願參與」和「知情同意」的國際文獻為何？
A. 希波克拉底誓詞（Hippocratic Oath）
B. 紐倫堡守則（the Nuremburg Code）
C. 貝爾蒙報告書（Belmont Report）
D. 赫爾辛基宣言（the Declaration of Helsinki）

正確答案：B. 紐倫堡守則（the Nuremburg Code）